Clinical trial exclusion criterion:
Fructose intolerance

Annotated entities:
- Condition: "Fructose intolerance"
- Drug: "Fructose"